Clinical trial inclusion criterion:
Adult acute myeloid leukemia

Annotated entities:
- Condition: "Adult acute myeloid leukemia"